Clinical trial inclusion criterion:
Pancreatectomy

Annotated entities:
- Procedure: "Pancreatectomy"